下列有關轉子區或轉子間骨折（peritrochanteric or intertrochanteric fracture）之敘述，何者最正確？
A. 此類骨折屬於關節囊內骨折（intracapsular fracture）
B. reverse oblique 形式之骨折屬於不穩定骨折
C. 穩定之骨折以非手術治療為原則
D. 不穩定且移位之骨折以人工半髖關節置換術（hemiarthroplasty）為治療原則

正確答案：B. reverse oblique 形式之骨折屬於不穩定骨折